History of allergy or hypersensitivity to Sugammadex and/or atropine or Neostigmine

The above is a clinical trial exclusion criterion. Annotated with entity spans:
[Temporal: History] of [Condition: allergy] or [Condition: hypersensitivity] to [Drug: Sugammadex] and/or [Drug: atropine] or [Drug: Neostigmine]